Age >18 years

The above is a clinical trial inclusion criterion. Annotated with entity spans:
[Person: Age] [Value: >18 years]